下列那種肺功能檢查數值最常被使用於術前手術風險的評估？
A. TLC（total lung capacity）
B. FRC（functional residual capacity）
C. FEV1（forced expiratory volume in first second）
D. IC（inspiratory capacity）

正確答案：C. FEV1（forced expiratory volume in first second）